Clinical trial inclusion criterion:
Systolic blood pressure >/= 90 mmHg

Entity relations:
- Has_value("Systolic blood pressure", ">/= 90 mmHg")